Clinical trial inclusion criterion:
Clinically diagnosed of Port-wine Stain;

Annotated entities:
- Condition: "Port-wine Stain"